Clinical trial exclusion criterion:
History of bupivacaine allergy

Annotated entities:
- Drug: "bupivacaine"
- Condition: "allergy"
- Temporal: "History"